current participation in any other clinical trial or participation in another clinical trial within 30 days before screening

The above is a clinical trial exclusion criterion. Annotated with entity spans:
[Competing_trial: current participation in any other clinical trial or participation in another clinical trial within 30 days before screening]